Clinical trial exclusion criterion:
Current medications with CNS effects

Entity relations:
- AND("medications", "CNS effects")